Clinical trial exclusion criterion:
Patients with an absolute body weight of less than 41 kilograms (90.4 lbs) at baseline visit;

Annotated entities:
- Measurement: "body weight"
- Value: "less than 41 kilograms"
- Value: "90.4 lbs"